Clinical trial inclusion criterion:
Females must have been surgically sterilized (hysterectomy, bilateral oophorectomy, or bilateral salpingo-oophorectomy; proper documentation required) at least 6 months before screening, or be postmenopausal (defined as 24 consecutive months without menses before screening, with a follicle-stimulating hormone [FSH] level of > 40 IU/L at screening).

Annotated entities:
- Person: "Females"
- Condition: "surgically sterilized"
- Procedure: "hysterectomy"
- Procedure: "bilateral oophorectomy"
- Procedure: "bilateral salpingo-oophorectomy"
- Temporal: "at least 6 months before"
- Reference_point: "screening"
- Condition: "postmenopausal"
- Temporal: "24 consecutive months"
- Condition: "menses"
- Negation: "without"
- Temporal: "before screening"
- Reference_point: "screening"
- Measurement: "follicle-stimulating hormone [FSH]"
- Value: "> 40 IU/L"
- Temporal: "at screening"
- Reference_point: "screening"